Zubrod performance status of 0-3

The above is a clinical trial inclusion criterion. Annotated with entity spans:
[Measurement: Zubrod performance status] of [Value: 0-3]